Clinical trial exclusion criterion:
Known allergy or intolerance to any of the study medications.

Annotated entities:
- Condition: "allergy"
- Condition: "intolerance"
- Drug: "study medications"